Clinical trial inclusion criterion:
Patient must be 18 years or older

Annotated entities:
- Person: "years"
- Value: "18 or older"